List major risk factors for Alzheimer's disease.

Apolipoprotein E4
type 2 diabetes
Clusterin
Hypertension
advancing age
obesity